Clinical trial inclusion criterion:
Person affiliated to social security or beneficiary of such a scheme

Annotated entities:
- Non-query-able: "Person affiliated to social security or beneficiary of such a scheme"